一位35歲的男性，因為意識不清被家人送至急診就醫，抽血檢查發現血鈉過高（160 mEq/L，參考值135～ mEq/L）。有關高血鈉（hypernatremia）的處理，下列描述何者最適當？
A. 估算全身水量（total-body water）：女性是體重的60%，而男性是體重的50%
B. 此病患若體重70公斤，計算free water缺乏量（free-water deficit）約5000 c.c.
C. 不易感知的水分流失（insensible losses）約5 mL/kg/day
D. 血鈉的矯正	量不超過10 mM/day，以避免腦部水腫（cerebral edema）

正確答案：D. 血鈉的矯正	量不超過10 mM/day，以避免腦部水腫（cerebral edema）